<37 weeks gestation, H/o Cesarean Section, Multiple Gestation, Pre-eclampsia, Narcotics within 3 hours prior to labor epidural placement, Chronic Pain (as defined by chronic opiate consumption), Women who are participating in another study that will impact protocol

The above is a clinical trial exclusion criterion. Annotated with entity spans:
[Value: <37 weeks] [Measurement: gestation], [Observation: H/o] [Procedure: Cesarean Section], [Condition: Multiple Gestation], [Condition: Pre-eclampsia], [Drug: Narcotics] [Temporal: within 3 hours prior to labor epidural placement], [Condition: Chronic Pain] (as defined by [Multiplier: chronic] [Drug: opiate] consumption), [Competing_trial: Women who are participating in another study that will impact protocol]